當以食指穿入心包橫竇（transverse pericardial sinus），那些血管會位於食指之前？
A. 肺動脈與下腔靜脈
B. 主動脈與上腔靜脈
C. 主動脈與肺動脈
D. 肺靜脈與上腔靜脈

正確答案：C. 主動脈與肺動脈